Clinical trial inclusion criterion:
5) ability to walk without assistance and without an AFO on the treadmill ≥ 30 seconds at speeds ranging from 0.2-0.8 m/s,

Entity relations:
- Has_value("AFO on the treadmill", "≥ 30 seconds")
- Has_negation("AFO on the treadmill", "without")
- Has_value("speeds", "from 0.2-0.8 m/s")
- Has_qualifier("AFO on the treadmill", "speeds")